Clinical trial exclusion criterion:
age less than 18 years old

Entity relations:
- Has_value("age", "less than 18 years old")